Clinical trial inclusion criterion:
tolerance of parenteral or enteral nutrition

Annotated entities:
- Condition: "tolerance"
- Procedure: "parenteral nutrition"
- Procedure: "enteral nutrition"